Clinical trial inclusion criteria:
elective Laparoscopic myomectomy patients 24hr post-operative patient controlled analgesia analgesia no mild or severe liver or renal disfunction

Annotated entities:
- Qualifier: "Laparoscopic"
- Procedure: "myomectomy"
- Qualifier: "elective"
- Line: "elective Laparoscopic myomectomy patients"
- Line: "24hr post-operative"
- Line: "patient controlled analgesia analgesia"
- Line: "no mild or severe liver or renal disfunction"
- Temporal: "24hr post-operative"
- Procedure: "patient controlled analgesia"
- Non-representable: "analgesia"
- Negation: "no"
- Qualifier: "mild"
- Qualifier: "severe"
- Condition: "renal disfunction"
- Condition: "liver disfunction"